Clinical trial exclusion criterion:
3. Cardiac pacemakers, neural stimulators, implantable defibrillator, implanted medication pumps, intracardiac lines, or acute, unstable cardiac disease, with intracranial implants (e.g. aneurysm clips, shunts, stimulators, cochlear implants, or electrodes) or any other metal object within or near the head that precludes MRI scanning.

Entity relations:
- Has_qualifier("cardiac disease", "unstable")
- Has_qualifier("cardiac disease", "acute")
- Has_negation("MRI scanning", "precludes")
- multi("precludes MRI scanning", "MRI scanning")
- Has_qualifier("metal object within or near the head", "precludes MRI scanning")
- Subsumes("intracranial implants", "aneurysm clips")
- AND("cardiac disease", "intracranial implants")
- OR("aneurysm clips", "cochlear implants", "stimulators", "shunts", "electrodes")
- OR("Cardiac pacemakers", "implanted medication pumps", "implantable defibrillator", "neural stimulators", "cardiac disease", "metal object within or near the head", "intracardiac lines")